What is the mode of inheritance of Facioscapulohumeral muscular dystrophy (FSHD)?

Facioscapulohumeral muscular dystrophy has an autosomal dominant inheritance pattern.